El Síndrome de Guillain-Barré es un trastorno desmielinizante inflamatorio agudo del sistema nervioso periférico. La pérdida de la fuerza muscular en la fase aguda puede suponer una urgencia, que en los casos graves deriva en:
1. Pérdida exclusiva de fuerza muscular en las extremidades inferiores.
2. Tetraplejia e insuficiencia respiratoria que precisan controlar el estado circulatorio del paciente, intubación endotraqueal y ventilación mecánica.
3. Agitación psicomotora que deriva a trastornos del sueño.
4. Escasa afectación de músculos costales y/o diafragmáticos.
5. Alteraciones exclusivamente sensoriales.

Respuesta correcta: 2. Tetraplejia e insuficiencia respiratoria que precisan controlar el estado circulatorio del paciente, intubación endotraqueal y ventilación mecánica.